no confirmation of the gestational age

The above is a clinical trial exclusion criterion. Annotated with entity spans:
[Negation: no] confirmation of the [Measurement: gestational age]